Clinical trial inclusion criterion:
Taking another PI containing regimens with suppressed viral load. It must be clearly stated in source document that if another PI was used for greater than 2 weeks the regimen was switched to another agent for convenience. Subjects with prior history of PI use may be enrolled, if there is a genotype showing no resistance to Kaletra Other Inclusion criteria

Entity relations:
- AND("regimens", "PI")
- Has_value("viral load", "suppressed")